對一位 24 公斤體重的兒童，如果完全不能進食。則維持性的靜脈輸液一天應給多少 mL？
A. 2400
B. 2000
C. 1580
D. 1250

正確答案：C. 1580